6. Modafinil

The above is a clinical trial exclusion criterion. Annotated with entity spans:
[Parsing_Error: 6.] [Drug: Modafinil]